Clinical trial exclusion criterion:
Subject has clinically compromised vertebral bodies at the index level(s) due to any traumatic, neoplastic, metabolic, or infectious pathology.

Entity relations:
- Has_qualifier("clinically compromised vertebral bodies", "index level(s)")
- AND("clinically compromised vertebral bodies", "traumatic pathology")
- OR("traumatic pathology", "neoplastic pathology", "infectious pathology", "metabolic pathology")